罹患內臟幼蟲移行症（visceral larva migrans）的病患通常有下列特徵，何者除外？
A. 犬蛔蟲（Toxocara canis）為主要病原體
B. 常見肝腫大
C. 常見嗜酸性白血球增多
D. 大多發生於成年人

正確答案：D. 大多發生於成年人